Gilles de la Tourette syndrome 的臨床診斷不包括：
A. vocal tics
B. attention deficit and hyperactivity
C. mental retardation
D. obsessive-compulsive behavior

正確答案：C. mental retardation